resection must have been histologically complete laterally with regard to the microinvasive cancer, that is to say with a clear margin of safety (margin may be high-grade dysplasia provided that the latter has not macroscopic translation),

The above is a clinical trial inclusion criterion. Annotated with entity spans:
[Condition: resection] must have been [Procedure: histologically] [Qualifier: complete laterally] with regard to the [Condition: microinvasive cancer], [Non-representable: that is to say with a clear margin of safety (margin may be high-grade dysplasia provided that the latter has not macroscopic translation),]